Clinical trial inclusion criterion:
no previous protease inhibitor resistance documented on HIV-1 genotypic resistance testing

Entity relations:
- AND("protease inhibitor resistance", "protease inhibitor")
- AND("HIV-1 genotypic resistance", "HIV-1")
- AND("HIV-1 genotypic resistance testing", "HIV-1 genotypic resistance")
- AND("protease inhibitor resistance", "HIV-1 genotypic resistance")